AIDS;

The above is a clinical trial exclusion criterion. Annotated with entity spans:
[Condition: AIDS];